La envoltura de los retrovirus procede de la (el):
1. Membrana plasmática.
2. Membrana nuclear.
3. Retículo endoplasmático.
4. Aparato de Golgi.
5. Mitocondria.

Respuesta correcta: 1. Membrana plasmática.